有關白內障對視力的影響，下列何者錯誤？
A. 後囊下白內障（posterior subcapsular cataract）因位於眼球之節點（nodal point），對視力影響最大
B. 後囊下白內障（posterior subcapsular cataract）患者之視力，在強光之下比較差
C. 核白內障（nuclear cataract）常伴隨遠視，有時反而改善近視力，閱讀時反而不需戴老花眼鏡
D. 皮質白內障（cortical cataract）病人較常會因光線散射而引起眩光（glare）問題

正確答案：C. 核白內障（nuclear cataract）常伴隨遠視，有時反而改善近視力，閱讀時反而不需戴老花眼鏡